Use of any of the prohibited medications listed in protocol.

The above is a clinical trial exclusion criterion. Annotated with entity spans:
[Context_Error: Use of any of the prohibited medications listed in protocol.]